Clinical trial inclusion criteria:
American society of anesthesiologist (ASA) physical status I or II

Annotated entities:
- Measurement: "American society of anesthesiologist physical status"
- Measurement: "ASA"
- Value: "I or II"